Clinical trial exclusion criterion:
1. History of uncontrolled hypertension

Annotated entities:
- Parsing_Error: "1."
- Condition: "hypertension"
- Qualifier: "uncontrolled"
- Temporal: "History"